Clinical trial inclusion criterion:
No history of death, serious myocardial infarction, stroke, repeat revascularization, or major bleeding

Annotated entities:
- Negation: "No"
- Temporal: "history"
- Condition: "death"
- Qualifier: "serious"
- Condition: "myocardial infarction"
- Condition: "stroke"
- Multiplier: "repeat"
- Procedure: "revascularization"
- Qualifier: "major"
- Condition: "bleeding"